Clinical trial exclusion criterion:
15. Women who are pregnant, lactating, or unwilling to use contraception if of childbearing potential

Entity relations:
- Has_mood("contraception", "unwilling")
- AND("childbearing potential", "contraception")
- OR("pregnant", "childbearing potential", "lactating")